Clinical trial exclusion criterion:
A moderate/severe COPD exacerbation that has not resolved at least 14 days prior to Visit 1 and at least 30 days following the last dose of oral corticosteroids (if applicable).

Annotated entities:
- Condition: "COPD exacerbation"
- Qualifier: "moderate"
- Qualifier: "severe"
- Temporal: "at least 14 days prior to Visit 1"
- Observation: "resolved"
- Negation: "not"
- Temporal: "at least 30 days following the last dose of oral corticosteroids"
- Reference_point: "the last dose of oral corticosteroids"